Gelatin allergy

The above is a clinical trial exclusion criterion. Annotated with entity spans:
[Drug: Gelatin] [Condition: allergy]